Clinical trial inclusion criterion:
1cm squared surface area

Annotated entities:
- Measurement: "surface area"
- Value: "1cm squared"